Clinical trial exclusion criterion:
Lesion larger than 4 cm in the longest dimension

Entity relations:
- AND("Lesion", "longest dimension")
- Has_value("longest dimension", "larger than 4 cm")